Clinical trial exclusion criterion:
Severe liver failure (CI to oral AVK)

Annotated entities:
- Condition: "liver failure"
- Qualifier: "Severe"